At least 18 years of age at the time of screening

The above is a clinical trial inclusion criterion. Annotated with entity spans:
[Value: At least 18 years] of [Person: age] at the time of screening